Clinical trial inclusion criterion:
Presence of hemodynamically relevant stenosis of one artery (i.e., the infarct-related artery) confirmed by coronary angiography (CAG), with the occlusion of other arteries not exceeding 30%.

Entity relations:
- Has_multiplier("stenosis of artery", "one")
- Subsumes("stenosis of artery", "infarct-related artery")
- Has_qualifier("stenosis of artery", "hemodynamically relevant")
- Subsumes("coronary angiography", "CAG")
- AND("coronary angiography", "stenosis of artery")
- Has_multiplier("occlusion of other arteries", "not exceeding 30%")